Clinical trial inclusion criteria:
Age = 15 years old
Hospitalization with acute undifferentiated fever (temperature > 37.5 C, tympanic) =14 days or patients admitted to hospital with a history of fever = 14 days who subsequently develop fever within 24 hours of admission
Clinically suspected scrub typhus: defined as acute undifferentiated fever with no clear focus of infection and negative malaria blood smear and/or negative malaria RDT. Patients may have one, none, or a combination of other clinical findings such as eschar, rash, lymphadenopathy, headache, myalgia, cough, nausea and abdominal discomfort.
A positive scrub typhus RDT (Scrub Typhus IgM RDT, InBios International, Seattle, WA, USA) and/or positive PCR-based detection of O. tsutsugamushi DNA from the admission blood sample
Written informed consent and/or, written informed assent as required
Able to take oral medication

Annotated entities:
- Person: "Age"
- Value: "= 15 years old"
- Procedure: "Hospitalization"
- Condition: "acute undifferentiated fever"
- Measurement: "temperature"
- Value: "> 37.5 C"
- Condition: "tympanic"
- Multiplier: "=14 days"
- Temporal: "history"
- Condition: "fever"
- Multiplier: "= 14 days"
- Condition: "fever"
- Temporal: "within 24 hours of admission"
- Procedure: "admitted to hospital"
- Reference_point: "admission"
- Condition: "scrub typhus"
- Condition: "acute undifferentiated fever"
- Condition: "focus of infection"
- Negation: "no clear"
- Value: "negative"
- Measurement: "malaria blood smear"
- Value: "negative"
- Measurement: "malaria RDT"
- Multiplier: "one"
- Multiplier: "none"
- Multiplier: "a combination of"
- Condition: "eschar"
- Condition: "rash"
- Condition: "lymphadenopathy"
- Condition: "headache"
- Condition: "myalgia"
- Condition: "cough"
- Condition: "nausea"
- Condition: "abdominal discomfort"
- Measurement: "scrub typhus RDT"
- Value: "positive"
- Procedure: "Scrub Typhus IgM RDT"
- Value: "positive"
- Procedure: "PCR"
- Qualifier: "O. tsutsugamushi DNA"
- Qualifier: "admission blood sample"
- Observation: "Written informed consent"
- Observation: "written informed assent"
- Observation: "Able to take oral medication"
- Drug: "oral medication"